Clinical trial exclusion criterion:
Cases with history of gastric ulcer diagnosed by upper endoscopy.

Annotated entities:
- Condition: "gastric ulcer"
- Temporal: "history"
- Procedure: "upper endoscopy"